Patients must be on stable hypoglycemic medications for at least 8 weeks prior to Visit 2 ( Day -1).

The above is a clinical trial inclusion criterion. Annotated with entity spans:
Patients must be on [Qualifier: stable] [Drug: hypoglycemic medications] for [Temporal: at least 8 weeks prior to Visit 2] ( Day -1).